S. aureus on at least 1 blood culture within 72 hours of beginning study drug (Cohort A) OR

The above is a clinical trial inclusion criterion. Annotated with entity spans:
[Observation: S. aureus] on [Multiplier: at least 1] [Procedure: blood culture] [Temporal: within 72 hours of beginning study drug] (Cohort A) OR